Clinical trial inclusion criterion:
6. Signed informed consent

Annotated entities:
- Parsing_Error: "6."
- Post-eligibility: "Signed informed consent"
- Non-query-able: "Signed informed consent"